Clinical trial exclusion criterion:
Diabetes Mellitus (insulin therapy)

Annotated entities:
- Condition: "Diabetes Mellitus"
- Drug: "insulin"